Has a history of lymphoproliferative disease

The above is a clinical trial exclusion criterion. Annotated with entity spans:
Has a history of [Condition: lymphoproliferative disease]